Clinical trial exclusion criterion:
Serum creatinine >2.5 mg/dL in men, or >2.0 mg/dL in women

Annotated entities:
- Measurement: "Serum creatinine"
- Value: ">2.5 mg/dL"
- Person: "men"
- Value: ">2.0 mg/dL"
- Person: "women"